Clinical trial exclusion criterion:
Any suspicion or history of alcohol abuse and/or consumption of other drugs of abuse

Annotated entities:
- Condition: "alcohol abuse"
- Observation: "suspicion"
- Temporal: "history"
- Condition: "consumption of other drugs of abuse"